Clinical trial inclusion criterion:
keratinized tissue must be present

Annotated entities:
- Condition: "keratinized tissue must be present"